Exclusions Based on Concomitant Medication Use

The above is a clinical trial exclusion criterion. Annotated with entity spans:
[Parsing_Error: Exclusions Based on Concomitant Medication Use]